Where are Paneth cells located?

Paneth cells are located in the intestinal crypt base columnar cells (CBCCs).